PDQ39 questionnaires is design for which disease?

PDQ39 is Parkinson's Disease Questionnaire that is used for assessment of quality of life in patients with Parkinson's Disease.